Patients in a critical medical situation.

The above is a clinical trial exclusion criterion. Annotated with entity spans:
Patients in a [Condition: critical medical situation].